Which epigenetic mark is deposited by PRC2?

polycomb repressive complex 2 (prc2 ) mediates trimethylation of lysine 27 on histone h3